下列何種 DNA 病毒顆粒具有環狀、雙股 DNA 基因體？
A. EB 病毒（Epstein-Barr virus）
B. 人類乳頭狀瘤病毒（Human Papillomavirus）
C. 腺病毒（Adnovirus）
D. 人類細小病毒（Parvovirus）B19

正確答案：B. 人類乳頭狀瘤病毒（Human Papillomavirus）